Clinical trial exclusion criterion:
Women who received chemotherapy for other disease entity in recent 1 year.

Entity relations:
- Has_temporal("chemotherapy", "recent 1 year")